Clinical trial inclusion criterion:
Ultrasound scanning at the first visit shows thickness of the achilles tendon above 7 mm or 20% thicker than the contralateral.

Entity relations:
- Has_temporal("Ultrasound scanning", "at the first visit")
- Has_qualifier("thickness of the achilles tendon", "above 7 mm")
- AND("Ultrasound scanning", "thickness of the achilles tendon")
- OR("above 7 mm", "20% thicker than the contralateral")